坐骨神經（sciatic nerve）的血液供應來自下列何者？
A. 臀下動脈（inferior gluteal artery）
B. 臀上動脈（superior gluteal artery）
C. 閉孔動脈（obturator artery）
D. 股動脈（femoral artery）

正確答案：A. 臀下動脈（inferior gluteal artery）